Clinical trial exclusion criterion:
Has a chronic illness (e.g., liver or kidney disease), receiving a concomitant therapy or have any other condition that could interfere with the subject's participation in the study or in the interpretation of the study results

Entity relations:
- Subsumes("chronic illness", "liver disease")
- Has_temporal("therapy", "concomitant")
- Has_qualifier("any other condition", "could interfere with the subject's participation in the study")
- OR("liver disease", "kidney disease")